Not pregnant

The above is a clinical trial exclusion criterion. Annotated with entity spans:
Not [Condition: pregnant]